Clinical trial inclusion criterion:
Taking acetylsalicylic acid (ASA) 100 mg daily treatment for at least 7 days or taking ASA 100 mg daily dose for less than 7 days but with 300 mg ASA loading dose before PCI.

Entity relations:
- Subsumes("acetylsalicylic acid", "ASA")
- multi("PCI", "PCI")
- Has_index("before PCI", "PCI")
- Has_multiplier("ASA", "300 mg")
- Has_temporal("ASA", "before PCI")
- Has_multiplier("ASA", "100 mg")
- Has_multiplier("ASA", "daily")
- Has_temporal("ASA", "for less than 7 days")
- Has_multiplier("acetylsalicylic acid", "100 mg")
- Has_multiplier("acetylsalicylic acid", "daily")
- Has_temporal("acetylsalicylic acid", "for at least 7 days")
- OR("acetylsalicylic acid", "ASA")